Clinical trial exclusion criterion:
extensive lysis of adhesions

Annotated entities:
- Condition: "lysis of adhesions"
- Qualifier: "extensive"